Clinical trial inclusion criterion:
Patients agreed to actively participate in the rehabilitation protocol and follow-up program;

Annotated entities:
- Observation: "agreed to actively participate in the rehabilitation protocol"
- Observation: "agreed to actively participate in the follow-up program"